Clinical trial exclusion criterion:
<18 years old

Annotated entities:
- Person: "old"
- Value: "<18 years"